diseases/drugs that influence on autonomic nervous system activity

The above is a clinical trial exclusion criterion. Annotated with entity spans:
[Condition: diseases]/[Drug: drugs] that [Qualifier: influence on autonomic nervous system activity]